下列何項不適宜作為因果關係的判斷基準？
A. 具正確的時序性
B. 有較高的相對危險性（Relative risk）
C. 從不同的研究或不同的族群，得到不同的結果
D. 呈現劑量-效應關係

正確答案：C. 從不同的研究或不同的族群，得到不同的結果